Clinical trial exclusion criterion:
Significant congenital anomaly or medical problem that in the opinion of the investigator would preclude enrollment in this study.

Annotated entities:
- Condition: "congenital anomaly"
- Qualifier: "Significant"
- Condition: "medical problem"
- Non-representable: "Significant congenital anomaly or medical problem that in the opinion of the investigator would preclude enrollment in this study"